¿Qué característica aumenta la veracidad de los autoinformes?
1. Solicitar información sobre eventos del pasado.
2. Solicitar información sobre eventos sobre los que el evaluado tenga poca experiencia.
3. Utilizar preguntas genéricas y abiertas.
4. Solicitar información sobre temas que impliquen poco al evaluado.
5. Utilizar preguntas específicas y poco ambiguas.

Respuesta correcta: 5. Utilizar preguntas específicas y poco ambiguas.